El sodio metal reacciona violentamente con el agua porque el Na:
1. Oxida el agua a oxígeno, y la reacción es muy exotérmica.
2. Reduce el agua a hidrógeno, y la reacción es muy exotérmica.
3. Oxida el agua a oxígeno, y al generarse un gas la entropía aumenta enormemente.
4. Reduce el agua a hidrógeno, y la reacción es muy endotérmica.
5. Se combina con el agua dando lugar a un hidruro explosivo.

Respuesta correcta: 2. Reduce el agua a hidrógeno, y la reacción es muy exotérmica.